Clinical trial inclusion criterion:
Healthy

Annotated entities:
- Value: "Healthy"